利用 280 nm 吸光值定量蛋白質是常用的方式，蛋白質的那一個胺基酸被破壞時會影響吸光值？
A. 絲胺基酸（serine）
B. 色胺基酸（tryptophan）
C. 天冬胺基酸（aspartic acid）
D. 甲硫胺基酸（methionine）

正確答案：B. 色胺基酸（tryptophan）